Clinical trial exclusion criterion:
The participant has unstable systemic disease.

Annotated entities:
- Condition: "systemic disease"
- Undefined_semantics: "systemic disease"
- Qualifier: "unstable"
- Subjective_judgement: "unstable"